Clinical trial inclusion criterion:
Is healthy on the basis of physical examination, medical history, electrocardiogram (ECG), and vital signs measurement performed at screening

Entity relations:
- AND("healthy", "electrocardiogram (ECG)")
- Has_temporal("electrocardiogram (ECG)", "at screening")
- Has_temporal("healthy", "medical history")
- AND("healthy", "physical examination")
- AND("healthy", "vital signs measurement")
- Has_temporal("medical history", "at screening")
- Has_temporal("physical examination", "at screening")
- Has_temporal("vital signs measurement", "at screening")